¿Dónde se genera el impulso anormal, si en el electrocardiograma observamos una onda P invertida, pero el complejo QRS y la onda T son normales?:
1. Nódulo sinoauricular.
2. Nódulo aurículoventricular.
3. Haz de His.
4. Sistema de Purkinje.

Respuesta correcta: 2. Nódulo aurículoventricular.